Women who are pregnant or breastfeeding, as well as those of reproductive potential unless there is a negative urine pregnancy test on the day of surgery;

The above is a clinical trial exclusion criterion. Annotated with entity spans:
[Pregnancy_considerations: Women who are pregnant or breastfeeding, as well as those of reproductive potential unless there is a negative urine pregnancy test on the day of surgery];